Continues on corticosteroids in previous 3 months prior to randomisation

The above is a clinical trial exclusion criterion. Annotated with entity spans:
Continues on [Drug: corticosteroids] in [Temporal: previous 3 months prior to randomisation]